Clinical trial exclusion criterion:
Patients with abnormal coagulation or any other contra-indication to use of standard biopsy in routine diagnostic endoscopic procedures

Annotated entities:
- Condition: "abnormal coagulation"
- Condition: "contra-indication"
- Procedure: "standard biopsy"
- Procedure: "diagnostic endoscopic procedures"